腦瘤合併顱內壓上升時，眼球會出現下列那一項變化？
A. 水晶體混濁
B. 眼壓下降
C. 視乳頭水腫
D. 視神經萎縮

正確答案：C. 視乳頭水腫